En el procesamiento y presentación de antígenos proteínicos por vía de la clase II del Complejo Principal de Histocompatibilidad humano, intervienen:
1. El proteasoma.
2. La tapasina.
3. Los transportadores TAP.
4. La molécula HLA-DM.

Respuesta correcta: 4. La molécula HLA-DM.